Clinical trial exclusion criterion:
History of a severe allergic reaction (e.g. anaphylaxis) to a previous dose of any hepatitis B vaccine

Entity relations:
- Has_temporal("hepatitis B vaccine", "previous")
- Has_qualifier("allergic reaction", "severe")
- Subsumes("allergic reaction", "anaphylaxis")
- AND("allergic reaction", "hepatitis B vaccine")